Los antígenos TI (independientes del timo):
1. Son buenos inductores de cambio isotípico.
2. Están compuestos por epítopos antigénicos repetidos idénticos.
3. Estimulan preferentemente a los linfocitos B foliculares.
4. Inducen anticuerpos de alta afinidad.

Respuesta correcta: 2. Están compuestos por epítopos antigénicos repetidos idénticos.